下列關於新生兒 herpes simplex virus（HSV）encephalitis 的敘述，何者為非？
A. 大多為 type 2 HSV 引起，但若母親有 genital herpes，C-section 可以減少新生兒罹病之危險
B. 潛伏期約 1－2 週
C. 85%為 post-partum infection
D. CSF 以 PCR 偵測 virus DNA 可以用來追蹤病人對 acyclovir 治療的療效

正確答案：C. 85%為 post-partum infection